Clinical trial exclusion criterion:
History of PCV-13 vaccination

Annotated entities:
- Temporal: "History"
- Procedure: "PCV-13 vaccination"